Clinical trial inclusion criteria:
First single stroke ischaemic or haemorrhagic responsible of an hemiplegia
Stoke since less than 2 month
A sufficient understood
A spasticity : a Tardieu score upper or equal to 2 on at least one of the following muscle-triceps surae, flexors of fingers, of wrist and of elbow
A free consent

Annotated entities:
- Multiplier: "First"
- Multiplier: "single"
- Condition: "stroke"
- Qualifier: "ischaemic"
- Qualifier: "haemorrhagic"
- Condition: "hemiplegia"
- Condition: "Stoke"
- Temporal: "since less than 2 month"
- Non-representable: "A sufficient understood"
- Condition: "spasticity"
- Measurement: "Tardieu score"
- Value: "upper or equal to 2"
- Multiplier: "at least one"
- Qualifier: "muscle-triceps surae"
- Qualifier: "flexors of fingers"
- Qualifier: "wrist"
- Qualifier: "elbow"
- Informed_consent: "A free consent"